¿Cuál es el mecanismo de acción del medicamento inmunosupresor everolimus?:
1. Inhibición de la activación de los linfocitos como receptores de membrana.
2. Inhibición de la transmisión de las señales de activación.
3. Inhibición de la síntesis de nucleótidos.
4. Inhibición de la migración de los linfocitos.
5. Inhibición de las señales de proliferación.

Respuesta correcta: 5. Inhibición de las señales de proliferación.